Parent or legal guardian willing to participate, and able to understand and sign the provided informed consent

The above is a clinical trial inclusion criterion. Annotated with entity spans:
[Informed_consent: Parent or legal guardian willing to participate, and able to understand and sign the provided informed consent]